Clinical trial inclusion criterion:
Cancer, with no active treatment in the last year

Annotated entities:
- Condition: "Cancer"
- Negation: "no"
- Procedure: "active treatment"
- Temporal: "in the last year"